下列何者不參與形成前顱窩（anterior cranial fossa）？
A. 顳骨（temporal bone）
B. 篩骨（ethmoid bone）
C. 蝶骨（sphenoid bone）
D. 額骨（frontal bone）

正確答案：A. 顳骨（temporal bone）